Clinical trial exclusion criterion:
Patients for whom endoscopic techniques are contraindicated

Entity relations:
- AND("contraindicated", "endoscopic techniques")